Clinical trial inclusion criterion:
Stable with < 20 mg prednisone (or equivalent) qd

Annotated entities:
- Multiplier: "< 20 mg qd"
- Drug: "prednisone"
- Condition: "Stable"